Clinical trial exclusion criterion:
Multiorgan transplants and/or previously transplanted with any other organ than kidney.

Entity relations:
- Has_temporal("transplanted with any other organ than kidney", "previously")
- OR("Multiorgan transplants", "transplanted with any other organ than kidney")